何者具有最大催化反應的能力？
A. 脫輔基酶（apoenzyme）
B. 輔酶（coenzyme）
C. 全酶（holoenzyme）
D. 酶原（zymogen）

正確答案：C. 全酶（holoenzyme）